下列何種狀況會造成胰島素（insulin）／昇糖素（glucagon）的 molar ratio 小於 0.5？
A. 進食大量碳水化合物
B. 靜脈注射葡萄糖
C. 進食少量餅乾
D. 飢餓

正確答案：D. 飢餓